Clinical trial inclusion criterion:
Hemoglobin >= 9 g/dL

Annotated entities:
- Measurement: "Hemoglobin"
- Value: ">= 9 g/dL"